Clinical trial exclusion criterion:
History of a severe allergic reaction (e.g. anaphylaxis) to a previous dose of any hepatitis B vaccine

Annotated entities:
- Qualifier: "severe"
- Condition: "allergic reaction"
- Condition: "anaphylaxis"
- Drug: "hepatitis B vaccine"
- Temporal: "previous"